Clinical trial exclusion criteria:
Women undergoing cesarean section with general anesthesia will be excluded, because carbetocin is licensed for use with regional anaesthesia only.
women undergoing cesarean section at less than 37 weeks of gestation.

Annotated entities:
- Person: "Women"
- Procedure: "cesarean section"
- Qualifier: "general anesthesia"
- Non-representable: "because carbetocin is licensed for use with regional anaesthesia only"
- Person: "women"
- Procedure: "cesarean section"
- Temporal: "less than 37 weeks"
- Measurement: "gestation"